有關新生兒篩檢 21-羥酶缺乏（21-hydroxylase deficiency）的敘述，下列那一項錯誤？
A. 可防止罹患失鹽型嬰兒（infants with salt-wasting disease）死於腎上腺危症（adrenal crisis）
B. 偽陽性（false-positive）率太高
C. 早產兒的偽陽性率比足月新生兒的偽陽性率低
D. 對非典型先天性腎上腺增生（nonclassical congenital adrenal hyperplasia）患兒的偵測仍不理想

正確答案：C. 早產兒的偽陽性率比足月新生兒的偽陽性率低